Not suitable for study per clinician judgement.

The above is a clinical trial exclusion criterion. Annotated with entity spans:
[Non-query-able: Not suitable for study per clinician judgement.]